Clinical trial exclusion criterion:
Patients with major psychiatric illness.

Annotated entities:
- Condition: "major psychiatric illness"